La principal utilidad de los experimentos conductuales en el tratamiento del trastorno de pánico es:
1. Ejemplificar el contenido psicoeducativo.
2. Facilitar la aceptación del tratamiento.
3. Poner a prueba las creencias disfuncionales acerca de las consecuencias de determinadas sensaciones corporales.
4. Demostrar que la ansiedad que experimenta el paciente en las situaciones es inferior a la anticipada.
5. Modelar la práctica aplicada de la relajación.

Respuesta correcta: 3. Poner a prueba las creencias disfuncionales acerca de las consecuencias de determinadas sensaciones corporales.